Clinical trial exclusion criterion:
Patients will be excluded if they have had exposure to a total daily dose of MET 1000 mg bid for at least 2 weeks in the past 3 months;

Entity relations:
- Has_multiplier("MET", "1000 mg bid")
- Has_temporal("MET", "at least 2 weeks in the past 3 months")